Clinical trial exclusion criterion:
Breast feeding or pregnancy

Entity relations:
- OR("Breast feeding", "pregnancy")